Patient with known CYP2C19 genotype prior to randomization

The above is a clinical trial inclusion criterion. Annotated with entity spans:
Patient with known [Condition: CYP2C19 genotype] [Temporal: prior to randomization]